Prostatitis

The above is a clinical trial exclusion criterion. Annotated with entity spans:
[Condition: Prostatitis]